En el test de Papanicolau, las muestras citológicas se deben recoger de:
1. La vulva, el cérvix y el interior de la cavidad uterina.
2. Las paredes vaginales y el fondo uterino.
3. El interior del cérvix, el orificio cervical externo y el saco vaginal posterior.
4. El introito vaginal y el exocérvix.
5. El endocervix y los sacos vaginales laterales.

Respuesta correcta: 3. El interior del cérvix, el orificio cervical externo y el saco vaginal posterior.